2. Off antiretroviral therapy (ART) for > 6 weeks before the study and no plans to begin treatment for the study duration. (The decision of whether or not a subject takes antiretroviral therapy will be made by the subject in consultation with his/her primary care provider prior to screening for this study.)

The above is a clinical trial inclusion criterion. Annotated with entity spans:
2. [Condition: Off antiretroviral therapy (ART)] for [Temporal: > 6 weeks before the study] and [Negation: no] [Mood: plans to begin] [Procedure: treatment] [Temporal: for the study duration]. (The decision of whether or not a subject takes antiretroviral therapy will be made by the subject in consultation with his/her primary care provider prior to screening for this study.)